38 歲停經前女性，其乳癌病理為浸潤性乳腺管道腺癌，腫瘤大小為 3.5 公分，女性賀爾蒙接受器（Estrogen Receptor）陰性，黃體酮接受器（Progesterone Receptor）陰性，第二型上皮成長因子接受器（HER2/NEU）為陰性，則其手術後該如何處理？
A. 不用輔助性治療
B. 輔助性化學藥物治療（Chemotherapy）
C. 輔助性標靶治療（Target therapy）
D. 輔助性抗賀爾蒙治療（Anti-estrogen therapy）

正確答案：B. 輔助性化學藥物治療（Chemotherapy）